List 4 targeted synthetic DMARDs that are JAK inhibitors.

Targeted synthetic (ts) DMARDs that are Janus kinase (JAK) inhibitors include tofacitinib, baricitinib, filgotinib, upadacitinib.